Clinical trial exclusion criterion:
history of chronic pain or regular (at least once daily) opioid use preoperatively

Entity relations:
- Has_multiplier("opioid", "at least once daily")
- Has_qualifier("opioid", "preoperatively")
- OR("chronic pain", "opioid")